myocardial infarction within the preceding 4 weeks

The above is a clinical trial exclusion criterion. Annotated with entity spans:
[Condition: myocardial infarction] [Temporal: within the preceding 4 weeks]